Participation in a study with an Investigational Medicinal Product (IMP) other than IgPro20 within three months prior to enrollment.

The above is a clinical trial exclusion criterion. Annotated with entity spans:
[Non-query-able: Participation in a study with an Investigational Medicinal Product (IMP) other than IgPro20 within three months prior to enrollment.]